經檢查後病患尿液正常，腹部 X 光檢查無異常，下列何者是檢查直腸損傷最適當之檢查項目？
A. 肛門指診
B. 硬式乙狀結腸鏡檢查
C. 大腸鏡纖維內視鏡檢查
D. 大腸鋇劑 X 光攝影檢查

正確答案：B. 硬式乙狀結腸鏡檢查